Currently on long term TDF anti-HBV treatment,

The above is a clinical trial inclusion criterion. Annotated with entity spans:
Currently on [Multiplier: long term] [Procedure: TDF anti-HBV treatment],